What does the strimvelis treatment consist of?

Strimvelis consists of autologous CD34+ cells transduced to express adenosine deaminase [ADA].